Clinical trial exclusion criterion:
Suspected or documented tuberculosis involving the central nervous system and/or bones and/or joints, and/or miliary tuberculosis and/or pericardial tuberculosis.

Entity relations:
- Has_qualifier("tuberculosis", "central nervous system")
- Has_mood("tuberculosis", "Suspected")
- OR("central nervous system", "bones", "joints", "miliary tuberculosis", "pericardial tuberculosis")
- OR("Suspected", "documented")